Clinical trial inclusion criterion:
Participants' must have signed an informed consent document indicating that they understand the purpose of and procedures required for the study and are willing to participate in the study

Annotated entities:
- Post-eligibility: "Participants' must have signed an informed consent document indicating that they understand the purpose of and procedures required for the study and are willing to participate in the study"
- Non-query-able: "Participants' must have signed an informed consent document indicating that they understand the purpose of and procedures required for the study and are willing to participate in the study"